Clinically significant, uncontrolled cardiac arrhythmia, unstable angina, congestive heart failure (NYHA Class 3 or 4), or history of myocardial infarction in the preceding 2 years.

The above is a clinical trial exclusion criterion. Annotated with entity spans:
Clinically significant, [Qualifier: uncontrolled] [Condition: cardiac arrhythmia], [Condition: unstable angina], [Condition: congestive heart failure] ([Measurement: NYHA Class] [Value: 3] or [Value: 4]), or history of [Condition: myocardial infarction] in the [Temporal: preceding 2 years].